Which human disease is associated with mutated UBQLN2

Ggene mutations in UBQLN2 cause dominant inheritance of amyotrophic lateral sclerosis (ALS).